Clinical trial exclusion criterion:
History of solid organ transplantation

Annotated entities:
- Condition: "solid organ transplantation"